Clinical trial exclusion criterion:
Pharmacological intervention (administration of corticosteroids, NSAIDs or paracetamol) or physical intervention (external cooling technique) that may influence temperature in the last 6 hours.

Annotated entities:
- Procedure: "Pharmacological intervention"
- Drug: "Pharmacological"
- Drug: "corticosteroids"
- Drug: "NSAIDs"
- Drug: "paracetamol"
- Procedure: "physical intervention"
- Procedure: "external cooling technique"
- Qualifier: "that may influence temperature"
- Temporal: "in the last 6 hours"
- Measurement: "temperature"